Patients intubated within one hour prior to care transition to the CICU will also be screened for inclusion.

The above is a clinical trial inclusion criterion. Annotated with entity spans:
Patients [Procedure: intubated] [Temporal: within one hour prior to care transition] to the CICU will also be screened for inclusion.